previous PCI in the target vessel

The above is a clinical trial exclusion criterion. Annotated with entity spans:
[Temporal: previous] [Procedure: PCI] in the [Qualifier: target vessel]